Patients must be able to take oral medication.

The above is a clinical trial inclusion criterion. Annotated with entity spans:
[Non-query-able: Patients must be able to take oral medication].